a history of major head injury

The above is a clinical trial exclusion criterion. Annotated with entity spans:
a history of [Condition: major head injury]